Human immunodeficiency virus infection

The above is a clinical trial exclusion criterion. Annotated with entity spans:
[Condition: Human immunodeficiency virus infection]